Clinical trial exclusion criterion:
Subject has abnormal long or short QT interval, signs of Brugada syndrome, known inheriting ion channel disease on the family, arrhythmogenic right ventricular dysplasia.

Entity relations:
- Has_qualifier("right ventricular dysplasia", "arrhythmogenic")
- Has_qualifier("long", "abnormal")
- Has_value("QT interval", "long")
- OR("long", "short")
- OR("QT interval", "Brugada syndrome", "inheriting ion channel disease on the family", "right ventricular dysplasia")